History of vitrectomy surgery, submacular surgery, or other surgical intervention for RVO

The above is a clinical trial exclusion criterion. Annotated with entity spans:
History of [Procedure: vitrectomy surgery], [Procedure: submacular surgery], or other [Procedure: surgical intervention] for [Condition: RVO]